Clinical trial inclusion criterion:
If taking cognitive enhancers (donepezil, rivastigmine, memantine, galantamine), must be on stable dose at least 30 days prior to screening, and be expected to remain on a stable dose for the duration of the study.

Annotated entities:
- Procedure: "cognitive enhancers"
- Drug: "donepezil"
- Drug: "rivastigmine"
- Drug: "memantine"
- Drug: "galantamine"
- Qualifier: "stable dose"
- Temporal: "at least 30 days prior to screening"
- Reference_point: "screening"